Clinical trial exclusion criterion:
no history of significant skin disease such as, but not limited to rash or eruptions, drug allergies, food allergy, dermatitis, eczema, psoriasis, or urticaria

Annotated entities:
- Condition: "skin disease"
- Temporal: "history"
- Qualifier: "significant"
- Undefined_semantics: "significant"
- Condition: "rash"
- Condition: "eruptions"
- Condition: "drug allergies"
- Condition: "food allergy"
- Condition: "dermatitis"
- Condition: "eczema"
- Condition: "psoriasis"
- Condition: "urticaria"